Clinical trial exclusion criterion:
History of Stroke in the last 3 months;

Entity relations:
- Has_temporal("Stroke", "in the last 3 months")
- Has_temporal("Stroke", "History of")